Signs and/or symptoms of ocular inflammation/infection (bacterial, viral, fungal, caused by Chlamydia, by Mycobacterium, Acanthamoeba or of allergic etiology).

The above is a clinical trial exclusion criterion. Annotated with entity spans:
Signs and/or symptoms of [Condition: ocular inflammation]/infection ([Qualifier: bacterial], [Qualifier: viral], [Qualifier: fungal], [Qualifier: caused by Chlamydia], by [Observation: Mycobacterium], [Observation: Acanthamoeba] or of [Condition: allergic etiology]).